共同髓原先驅細胞（common myeloid progenitor cell）可以分化成不同種類之血球成員，但不包含下列那一種？
A. 血小板（platelets）
B. 自然殺手細胞（natural killer cells）
C. 單核細胞（monocytes）
D. 多核狀顆粒細胞（polymorphonuclear granulocytes）

正確答案：B. 自然殺手細胞（natural killer cells）